Clinical trial inclusion criterion:
Onset of symptoms < 3 hours prior to randomisation

Annotated entities:
- Observation: "Onset of symptoms"
- Temporal: "< 3 hours prior to randomisation"
- Reference_point: "randomisation"